body mass index (BMI) between 19 to 30 kg/m2 and body weight between 50 to 100 kg inclusive

The above is a clinical trial inclusion criterion. Annotated with entity spans:
[Measurement: body mass index (BMI)] [Value: between 19 to 30 kg/m2] and [Measurement: body weight] between [Value: 50 to 100 kg inclusive]